Males and females of 18 years of age or older at the time of the vaccination

The above is a clinical trial inclusion criterion. Annotated with entity spans:
[Person: Males] [Grammar_Error: and] [Person: females] of [Value: 18 years] of [Person: age] or older [Temporal: at the time of the vaccination]